Clinical trial exclusion criterion:
Subject who would receive more than 4500 euros of compensation due to his participation in other biomedical research in the 12 months preceding this study

Annotated entities:
- Non-query-able: "Subject who would receive more than 4500 euros of compensation due to his participation in other biomedical research in the 12 months preceding this study"
- Context_Error: "Subject who would receive more than 4500 euros of compensation due to his participation in other biomedical research in the 12 months preceding this study"